inability to obtain valid data from

The above is a clinical trial exclusion criterion. Annotated with entity spans:
[Non-query-able: inability to obtain valid data from]